Clinical trial exclusion criterion:
Uncontrolled hypertension or metabolic disease

Annotated entities:
- Condition: "hypertension"
- Condition: "metabolic disease"
- Qualifier: "Uncontrolled"